El coeficiente de absorción molar de un compuesto:
1. Tiene como dimensiones M-1 cm-1, es constante a una longitud de onda concreta y en un disolvente particular.
2. Tiene como dimensiones mol L-1 cm-2 y es constante a una longitud de onda dada y en un disolvente dado.
3. Tiene como dimensiones L mol-1 cm-3 y es constante en toda la región espectral y no está influenciado por el disolvente.
4. Tiene como dimensiones Fotones por mol y varía con la longitud de onda y con el disolvente.
5. Es adimensional, constante y no varía ni con la longitud de onda ni con el disolvente.

Respuesta correcta: 1. Tiene como dimensiones M-1 cm-1, es constante a una longitud de onda concreta y en un disolvente particular.